Male or female children between the ages of 10 and 35 years with congenital heart disease that has been palliated with a Fontan circulation.

The above is a clinical trial inclusion criterion. Annotated with entity spans:
[Person: Male] or [Person: female] [Person: children] [Value: between] the [Person: ages] of 10 and 35 years with [Condition: congenital heart disease] that has been palliated with a [Procedure: Fontan circulation].